What is F105-P?

F105-P is a protamine-antibody fusion protein designed to deliver siRNA to HIV-infected or envelope-transfected cells. In specific, it was designed with the protamine coding sequence linked to the C terminus of the heavy chain Fab fragment of an HIV-1 envelope antibody.